Clinical trial exclusion criterion:
< 37-0 weeks of gestation

Entity relations:
- Has_value("gestation", "< 37-0 weeks")